Clinical trial exclusion criterion:
Women who cannot cooperate with the examinations.

Annotated entities:
- Post-eligibility: "Women who cannot cooperate with the examinations"